Patients who experienced organ failure by acute exacerbation of liver cirrhosis within the past 1 month

The above is a clinical trial exclusion criterion. Annotated with entity spans:
Patients who experienced [Condition: organ failure] by [Condition: acute exacerbation of liver cirrhosis] within the [Temporal: past 1 month]